下列何者不直接緊貼膀胱的後表面？
A. 子宮
B. 陰道
C. 直腸
D. 輸精管

正確答案：C. 直腸